4. Subject and/or guardian must be able to comply with the study protocol.

The above is a clinical trial inclusion criterion. Annotated with entity spans:
4. [Non-query-able: Subject and/or guardian must be able to comply with the study protocol.]